Clinical trial exclusion criterion:
Severe respiratory, digestive, hematological disease (including Anemia of Hb < 100 gram per litre) or tumor.

Annotated entities:
- Condition: "respiratory disease"
- Condition: "digestive disease"
- Condition: "hematological disease"
- Qualifier: "Severe"
- Condition: "Anemia"
- Measurement: "Hb"
- Value: "< 100 gram per litre"
- Condition: "tumor"